Una de las siguientes manifestaciones clínicas es propia del hipotiroidismo:
1. Intolerancia al calor.
2. Bradicardia.
3. Pérdida de peso.
4. Diarrea.

Respuesta correcta: 2. Bradicardia.